Clinical trial inclusion criterion:
Women without PCOS as defined by the Rotterdam criteria.

Entity relations:
- Has_qualifier("PCOS", "Rotterdam criteria")
- Has_negation("PCOS", "without")